History of any major internal disease (including diabetes, cardiovascular disease, lung disease, liver or kidney disease);

The above is a clinical trial exclusion criterion. Annotated with entity spans:
History of any [Condition: major internal disease] (including [Condition: diabetes], [Condition: cardiovascular disease], [Condition: lung disease], [Condition: liver] or [Condition: kidney disease]);